History of Acute Myeloid Leukemia (AML) or high risk for AML

The above is a clinical trial exclusion criterion. Annotated with entity spans:
History of [Condition: Acute Myeloid Leukemia] ([Condition: AML]) or [Qualifier: high] [Observation: risk for AML]